Clinical trial inclusion criterion:
Have RA, as defined by the 1987 revised American College of Rheumatology criteria

Entity relations:
- Has_qualifier("RA", "1987 revised American College of Rheumatology criteria")